Have normal screening laboratories for white blood cells (WBC), hemoglobin (Hgb), platelets, sodium, potassium, chloride, bicarbonate, blood urea nitrogen (BUN), creatinine, ALT (liver function), AST (liver function) and bilirubin

The above is a clinical trial inclusion criterion. Annotated with entity spans:
Have [Value: normal] screening laboratories for [Measurement: white blood cells] ([Measurement: WBC]), [Measurement: hemoglobin] ([Measurement: Hgb]), [Measurement: platelets], [Measurement: sodium], [Measurement: potassium], [Measurement: chloride], [Measurement: bicarbonate], [Measurement: blood urea nitrogen] ([Measurement: BUN]), [Measurement: creatinine], [Measurement: ALT] (liver function), [Measurement: AST] (liver function) and [Measurement: bilirubin]